What is the advantage of using long nano columns in proteomics?

The longer the columns, the longer gradients are applied and finally more proteins (increased peak capacity) are identified in a complex  proteomic experiment